Clinical trial exclusion criteria:
Type 1 diabetes (autoantibody positive).
Any history of receiving GLP-1 analogues or dipeptidyl peptidase inhibitors within 6 months
Known severe heart failure, classified as NYHA 4.
Active myocarditis; malfunctioning artificial heart valve.
History of ventricular tachycardia within 3 months before study entry; second- or third-degree atrioventricular block.
Supine systolic blood pressure <85 mm Hg or >200 mm Hg at screening.
Primary renal impairment, creatinine clearance < 45 ml/min if treated with metformin.
Uncorrected hypokalemia or hyperkalemia (potassium <3.5 mmol/l or >5.5 mmol/l).
Significant anemia (Hb < 90 g/l)
Severe gastrointestinal disease, including gastroparesis. As judged by the Investigator.
Body mass index (BMI) > 45 kg/m2.
Malignant neoplasm requiring chemotherapy, surgery, radiation or palliative therapy in the previous 5 years. Patients with intraepithelial squamous cell carcinoma of the skin treated with topical 5FU and subjects with basal cell skin cancer are allowed to enter the trial.
Females of child bearing potential who are pregnant, breast-feeding or intend to become pregnant.
Current drug and alcohol abuse.
History of acute or chronic pancreatitis
Subjects considered by the Investigator to be unsuitable for the study.

Annotated entities:
- Condition: "Type 1 diabetes"
- Measurement: "autoantibody"
- Value: "positive"
- Drug: "GLP-1 analogues"
- Drug: "dipeptidyl peptidase inhibitors"
- Temporal: "within 6 months"
- Condition: "heart failure"
- Qualifier: "severe"
- Measurement: "NYHA"
- Value: "4"
- Condition: "Active myocarditis"
- Device: "artificial heart valve"
- Qualifier: "malfunctioning"
- Condition: "ventricular tachycardia"
- Temporal: "within 3 months"
- Condition: "third-degree atrioventricular block"
- Condition: "second- degree atrioventricular block"
- Measurement: "systolic blood pressure"
- Qualifier: "Supine"
- Value: "<85 mm Hg"
- Value: ">200 mm Hg"
- Condition: "Primary renal impairment"
- Measurement: "creatinine clearance"
- Value: "< 45 ml/min"
- Drug: "metformin"
- Condition: "hypokalemia"
- Condition: "hyperkalemia"
- Measurement: "potassium"
- Value: "<3.5 mmol/l"
- Value: ">5.5 mmol/l"
- Condition: "anemia"
- Qualifier: "Significant"
- Measurement: "Hb"
- Value: "< 90 g/l"
- Condition: "gastrointestinal disease"
- Qualifier: "Severe"
- Condition: "gastroparesis"
- Measurement: "Body mass index"
- Measurement: "BMI"
- Value: "> 45 kg/m2"
- Condition: "Malignant neoplasm"
- Procedure: "chemotherapy"
- Procedure: "surgery"
- Procedure: "radiation"
- Procedure: "palliative therapy"
- Temporal: "previous 5 years."
- Negation: "allowed"
- Condition: "intraepithelial squamous cell carcinoma"
- Qualifier: "skin"
- Drug: "topical 5FU"
- Condition: "basal cell skin cancer"
- Pregnancy_considerations: "Females of child bearing potential who are pregnant, breast-feeding or intend to become pregnant"
- Condition: "alcohol abuse"
- Condition: "drug abuse"
- Condition: "acute pancreatitis"
- Condition: "chronic pancreatitis"
- Non-query-able: "Subjects considered by the Investigator to be unsuitable for the study"